補體（complement）系統中的凝集路徑（lectin pathway），是細菌感染時，其表面的醣蛋白或碳水化合物中的 mannose 部分和 mannose-binding lectin（MBL）結合所啟動的，則 MBL 和補體系統中的那一個分子功能相似？
A. C1q
B. C2a
C. C3b
D. C4a

正確答案：A. C1q